Previous history of ovarian surgery or surgical removal of one ovary.

The above is a clinical trial exclusion criterion. Annotated with entity spans:
Previous history of [Procedure: ovarian surgery] or [Procedure: surgical removal] of [Multiplier: one] [Qualifier: ovary].